Where is the protein Pannexin1 located?

The protein Pannexin1 is localized to the plasma membranes.